Clinical trial exclusion criterion:
Significant travel with work.

Annotated entities:
- Non-representable: "Significant travel with work."